Clinical trial exclusion criterion:
Patients with hip fractures not requiring surgery (e.g. greater trochanter avulsion) will also be excluded.

Entity relations:
- Has_negation("requiring surgery", "not")
- Has_qualifier("hip fractures", "requiring surgery")
- Subsumes("hip fractures", "greater trochanter avulsion")
- Subsumes("surgery", "greater trochanter avulsion")